Allergy known to fish

The above is a clinical trial exclusion criterion. Annotated with entity spans:
[Condition: Allergy] known to [Drug: fish]